Oral contraceptive

The above is a clinical trial exclusion criterion. Annotated with entity spans:
[Drug: Oral contraceptive]